Clinical trial exclusion criterion:
Liver cirrhosis (Child-Pugh all stages)

Annotated entities:
- Condition: "Liver cirrhosis"
- Measurement: "Child-Pugh"
- Value: "all stages"